¿Qué células del aparato yuxtaglomerular sintetizan y almacenan renina?:
1. Las células de la mácula densa.
2. Las células mesangiales.
3. Las células principales.
4. Las células yuxtaglomerulares.
5. Las células intercaladas.

Respuesta correcta: 4. Las células yuxtaglomerulares.